Clinical trial inclusion criterion:
Women aged 25-75 years old.

Entity relations:
- Has_value("aged", "25-75 years old")